Any condition that in the opinion of the investigator may interfere with adherence to trial protocol

The above is a clinical trial exclusion criterion. Annotated with entity spans:
[Non-query-able: Any condition that in the opinion of the investigator may interfere with adherence to trial protocol]